Be allergic or have contraindications to nitroglycerin or other nitrates.

The above is a clinical trial exclusion criterion. Annotated with entity spans:
Be [Condition: allergic] or have [Condition: contraindications] to [Drug: nitroglycerin] or other [Drug: nitrates].